Which software are used for the detection of selective sweeps?

Four open-source software releases (SweeD, SweepFinder, SweepFinder2, and OmegaPlus) are able to detect selective sweeps accurately. RAiSD (Raised Accuracy in Sweep Detection), an open-source software implements a parameter-free detection mechanism that relies on multiple signatures of a selective sweep via the enumeration of SNP vectors.